Clinical trial inclusion criterion:
• History of physician-diagnosed inflammatory bowel disease (IBD)

Annotated entities:
- Condition: "inflammatory bowel disease (IBD)"
- Temporal: "History"